Clinical trial exclusion criterion:
Systolic pulmonary artery pressure (SPAP) >40 mmHg (and/or tricuspid regurgitation [TR] jet velocity >2.9 m/s) In cases where an actual SPAP value is not measurable due to lack of adequate TR jet, the pulmonary flow acceleration time measured at the right ventricular outflow tract (RVOTAT) will be used to assess eligibility. Participants with a RVOTAT =100 milliseconds (msec) will be excluded, suggesting an elevated mean SPAP; eligibility for the those participants with RVOTAT between 100 and 120 msec will be determined based on combined assessment of the TR jet, septal motion, and right ventricular size.

Annotated entities:
- Measurement: "Systolic pulmonary artery pressure (SPAP)"
- Value: ">40 mmHg"
- Measurement: "tricuspid regurgitation [TR] jet velocity"
- Value: ">2.9 m/s"
- Measurement: "RVOTAT"
- Value: "=100 milliseconds (msec)"
- Non-representable: "In cases where an actual SPAP value is not measurable due to lack of adequate TR jet, the pulmonary flow acceleration time measured at the right ventricular outflow tract (RVOTAT) will be used to assess eligibility."
- Non-representable: "suggesting an elevated mean SPAP; eligibility for the those participants with RVOTAT between 100 and 120 msec will be determined based on combined assessment of the TR jet, septal motion, and right ventricular size."